對於leprosy常見併發症的敘述，下列何者錯誤？
A. 因為神經喪失疼痛知覺，因此常有末端指節關節受傷或是截肢現象
B. 因為副交感神經受損，因此常有掌蹠多	現象
C. 可發生keratitis，甚至會失明
D. 鼻樑塌陷

正確答案：B. 因為副交感神經受損，因此常有掌蹠多	現象